4. significant coagulopathy( prothrombin time >15 seconds, INR>1.5

The above is a clinical trial exclusion criterion. Annotated with entity spans:
4. [Qualifier: significant] [Condition: coagulopathy]( [Measurement: prothrombin time] [Value: >15 seconds], [Measurement: INR][Value: >1.5]